Subjects who had a serious adverse events during stem cell therapy

The above is a clinical trial exclusion criterion. Annotated with entity spans:
Subjects who had a [Undefined_semantics: serious adverse events] [Temporal: during] [Reference_point: stem cell therapy]